Clinical trial inclusion criterion:
Willingness to participate in all study procedures

Annotated entities:
- Non-query-able: "Willingness to participate in all study procedures"